痛覺與溫度感覺受器的訊息可經由下列那一條神經路徑傳遞至體感覺皮質？
A. dorsal column system
B. anterolateral system
C. corticospinal system
D. corticobulbar system

正確答案：B. anterolateral system